外陰癌（vulvar cancer）stage Ia，即微侵襲性癌（microinvasive carcinoma），為小於或等於 2 公分的腫瘤，其侵犯深度為：
A. 小於 1 mm
B. 小於 2 mm
C. 小於 5 mm
D. 小於 8 mm

正確答案：A. 小於 1 mm